Clinical trial exclusion criterion:
Infection at or near the intended needle insertion site

Annotated entities:
- Condition: "Infection"
- Qualifier: "intended needle insertion site"